Clinical trial inclusion criterion:
Children aged 3-16 with a parent/guardian (hereafter termed parent) reported history of allergy to a penicillin antibiotic in which the reported allergic reaction occurred at least six months prior to the current PED visit.

Annotated entities:
- Person: "Children"
- Person: "aged"
- Value: "3-16"
- Condition: "allergy"
- Drug: "penicillin antibiotic"
- Temporal: "at least six months prior to the current PED visit"
- Condition: "allergic reaction"